Un lugar promotor en el ADN:
1. Transcribe el represor.
2. Inicia la transcripción.
3. Codifica la ARN polimerasa.
4. Regula la terminación.
5. Traduce proteínas específicas.

Respuesta correcta: 2. Inicia la transcripción.